Idiopathic Parkinson's disease ( Hughes AJ et al. 2001)

The above is a clinical trial inclusion criterion. Annotated with entity spans:
[Qualifier: Idiopathic] [Condition: Parkinson's disease] ( Hughes AJ et al. 2001)